Known history of prior intracranial bleeding

The above is a clinical trial exclusion criterion. Annotated with entity spans:
Known history of [Qualifier: prior] [Condition: intracranial bleeding]